Clinical trial inclusion criterion:
Non-ambulatory or 'exercise only' ambulators with or without assistive devices

Annotated entities:
- Observation: "Non-ambulatory"
- Observation: "'exercise only' ambulators"
- Device: "assistive devices"